Clinical trial exclusion criterion:
QTc interval over 450 msec or risk factors for torsades de pointes or on Class IA and Class III anti arrhythmic medications

Annotated entities:
- Measurement: "QTc interval"
- Value: "over 450 msec"
- Observation: "risk factors for torsades de pointes"
- Drug: "Class III anti arrhythmic medications"
- Drug: "Class IA anti arrhythmic medications"